Cuando un paciente para aliviar la ansiedad hace un uso compulsivo y mal adaptativo de una sustancia, decimos que presenta:
1. Atracción.
2. Consumo.
3. Tolerancia.
4. Adicción.

Respuesta correcta: 4. Adicción.